Clinical trial inclusion criterion:
Patients with histologically confirmed advanced (stage IV) gastric cancer, NSCLC, breast cancer or ovarian cancer, who choose monotherapy of oral vascular targeting drug (apatinib) due to intolerability or inappropriateness of other therapies;

Entity relations:
- Subsumes("advanced", "stage IV")
- multi("histologically confirmed", "histologically")
- Subsumes("oral vascular targeting drug", "apatinib")
- AND("monotherapy", "oral vascular targeting drug")
- Has_qualifier("gastric cancer", "advanced")
- Has_qualifier("gastric cancer", "histologically confirmed")
- OR("gastric cancer", "NSCLC", "breast cancer", "ovarian cancer")